Clinical trial inclusion criteria:
Patients undergoing a high tibial osteotomy (HTO)
Patients undergoing tibial tubercle osteotomy (TTO) with or without medial patello-femoral ligament (MPFL) reconstruction

Annotated entities:
- Procedure: "high tibial osteotomy (HTO)"
- Temporal: "undergoing"
- Temporal: "undergoing"
- Procedure: "tibial tubercle osteotomy (TTO)"
- Procedure: "medial patello-femoral ligament (MPFL) reconstruction"